當病人出現下列那一個症狀，比較有可能不是原發性的巴金森氏病（idiopathic Parkinson disease）？
A. 嗅覺減退（hyposmia）
B. 不寧腳症候群（restless legs syndrome）
C. 皮質性感覺喪失（cortical sensory loss）
D. 快速動眼期睡眠行為異常（rapid eye movement sleep behavior disorder）

正確答案：C. 皮質性感覺喪失（cortical sensory loss）